How are super enhancers defined?

Super-enhancers (SEs) are large clusters of enhancers that drive expression of genes controlling cell identity. Super-enhancers are important for controlling and defining the expression of cell-specific genes.